Male or female outpatients aged at least 18 years and not more than 45 years.

The above is a clinical trial inclusion criterion. Annotated with entity spans:
[Person: Male] or [Person: female] [Visit: outpatients] [Person: aged] [Value: at least 18 years and not more than 45 years].